En relación con la biosíntesis de ácidos grasos, es cierto que:
1. La vía de las pentosas-fosfato aporta la cantidad de NADH necesaria.
2. La biosíntesis de ácido palmítico necesita 8 moléculas de malonil-CoA.
3. El acetil-CoA necesario procede mayoritariamente de la oxidación de glucosa o de algunos aminoácidos.
4. La CoA pasa de la mitocondria al citosol mediante un transportador específico.

Respuesta correcta: 3. El acetil-CoA necesario procede mayoritariamente de la oxidación de glucosa o de algunos aminoácidos.